YAG laser treatment in the study eye in last 30 days prior to study enrollment.

The above is a clinical trial exclusion criterion. Annotated with entity spans:
[Procedure: YAG laser treatment] [Qualifier: in the study eye] [Temporal: in last 30 days prior to study enrollment].